Which network analysis method can you use for prioritization of metabolic disease genes?

MetPropagate is a network-guided propagation of metabolomic information for prioritization of metabolic disease genes. Basically, you take a single patient and a group of controls, and compare their metabolomic data to the data of other patients with IEMs. If you find a gene that is in the top 20% of the population, you rank it higher than the other genes in the population. If not, you don't.